Clinical trial exclusion criterion:
Serum Aspartate Aminotransferase (AST) > triple the upper limit of the normal value range and/or

Annotated entities:
- Measurement: "Serum Aspartate Aminotransferase"
- Measurement: "AST"
- Value: "> triple the upper limit of the normal value range"
- Non-query-able: "and/or"